Which NADPH oxidase family member requires interaction with NOXO1 for function?

NADPH oxidase 1 (NOX1) requires interaction with NOXO1 for function.